Hepatic or hematologic abnormality

The above is a clinical trial exclusion criterion. Annotated with entity spans:
[Condition: Hepatic] or [Condition: hematologic abnormality]